List types of DNA lesions caused by UV light.

cyclobutane pyrimidine dimers
pyrimidine pyrimidone photoproducts
8-oxo-7,8-dihydroguanine